Clinical trial exclusion criterion:
Previous pelvic or abdominal radiotherapy

Annotated entities:
- Procedure: "pelvic radiotherapy"
- Procedure: "abdominal radiotherapy"
- Temporal: "Previous"